Clinical trial exclusion criterion:
Contraindication to oxycodone

Annotated entities:
- Condition: "Contraindication"
- Drug: "oxycodone"